Clinical trial exclusion criterion:
Patients who are already involved in any other trial.

Annotated entities:
- Non-query-able: "Patients who are already involved in any other trial."